pregnant or breastfeeding

The above is a clinical trial exclusion criterion. Annotated with entity spans:
[Condition: pregnant] or [Observation: breastfeeding]